English- or Spanish-speaking parent(s)/legally authorized representative(s) (LAR(s))

The above is a clinical trial inclusion criterion. Annotated with entity spans:
[Non-query-able: English- or Spanish-speaking parent(s)/legally authorized representative(s) (LAR(s))]